Clinical trial inclusion criterion:
Presenting with hernia requiring surgical intervention

Annotated entities:
- Condition: "hernia"
- Mood: "requiring"
- Procedure: "surgical intervention"